Clinical trial exclusion criterion:
Severe Renal dysfunction (Ccr<30 ml/min)

Annotated entities:
- Condition: "Renal dysfunction"
- Qualifier: "Severe"
- Measurement: "Ccr"
- Value: "<30 ml/min"